Clinical trial exclusion criterion:
eGFR(Epidermal growth factor receptor) < 50mL/min

Entity relations:
- Subsumes("eGFR", "Epidermal growth factor receptor")
- Has_value("eGFR", "< 50mL/min")